Clinical trial inclusion criterion:
Systolic blood pressure> 90 mmHg

Annotated entities:
- Measurement: "Systolic blood pressure"
- Value: "> 90 mmHg"